Clinical trial exclusion criteria:
Rest pain or tissue loss due to PAD (Fontaine stage III and IV),
acute lower extremity ischemic event secondary to thromboembolic disease or acute trauma,
Walking capacity significantly limited by conditions other than claudication including leg (joint/musculoskeletal, neurologic) and systemic (heart, lung disease) pathology,
Current use of either ACE inhibitors or angiotensin II receptor blockers,
Chronic kidney disease with estimated Glomerular Filtration Rate < 30 ml/min/1.73 m2,
History of bilateral severe renal artery stenosis and 7) History of angioedema related to previous ACE-inhibitor treatment or known hypersensitivity to ramipril or other ACE inhibitors.

Annotated entities:
- Condition: "Rest pain"
- Condition: "tissue loss"
- Condition: "PAD"
- Measurement: "Fontaine stage"
- Value: "III"
- Value: "IV"
- Qualifier: "acute"
- Qualifier: "lower extremity"
- Condition: "ischemic event"
- Qualifier: "secondary to thromboembolic disease"
- Qualifier: "secondary to acute trauma"
- Condition: "thromboembolic disease"
- Condition: "acute trauma"
- Measurement: "Walking capacity"
- Value: "significantly limited"
- Condition: "claudication"
- Negation: "other than"
- Condition: "leg pathology"
- Condition: "systemic pathology"
- Qualifier: "joint"
- Qualifier: "musculoskeletal"
- Qualifier: "neurologic"
- Condition: "heart disease"
- Condition: "lung disease"
- Condition: "conditions other than claudication"
- Qualifier: "other than claudication"
- Drug: "ACE inhibitors"
- Temporal: "Current use"
- Drug: "angiotensin II receptor blockers"
- Condition: "Chronic kidney disease"
- Measurement: "estimated Glomerular Filtration Rate"
- Value: "< 30 ml/min/1.73 m2"
- Temporal: "History"
- Qualifier: "bilateral"
- Qualifier: "severe"
- Condition: "renal artery stenosis"
- Temporal: "History"
- Condition: "angioedema"
- Temporal: "previous"
- Procedure: "ACE-inhibitor treatment"
- Drug: "ACE-inhibitor"
- Qualifier: "known"
- Condition: "hypersensitivity"
- Drug: "ramipril"
- Drug: "ACE inhibitors"